Prior or current use of any CCR5 antagonist (such as MVC and cenicriviroc [CVC]) and integrase inhibitor (such as RAL, DTG, and elvitegravir [EVG])

The above is a clinical trial exclusion criterion. Annotated with entity spans:
[Temporal: Prior] or [Temporal: current] use of any [Drug: CCR5 antagonist] (such as [Drug: MVC] and [Drug: cenicriviroc [CVC]]) and [Drug: integrase inhibitor] (such as [Drug: RAL], [Drug: DTG], and [Drug: elvitegravir [EVG]])